股骨骨折可併發脂肪栓塞，下列那些是診斷脂肪栓塞的三大要件？①意識混亂 ②呼吸困難 ③胸 痛 ④皮下點狀出血
A. ①②③
B. ①②④
C. ①③④
D. ②③④

正確答案：B. ①②④